Clinical trial exclusion criterion:
Patients who have taken either morphine with daily dose more than 120mg or Fentanyl with daily dose more than 50ug/hr

Annotated entities:
- Drug: "morphine"
- Multiplier: "daily dose more than 120mg"
- Drug: "Fentanyl"
- Multiplier: "daily dose more than 50ug/hr"